Subjects who are unable to undergo the MRI

The above is a clinical trial exclusion criterion. Annotated with entity spans:
Subjects who are [Mood: unable to] undergo the [Procedure: MRI]